Clinical trial exclusion criterion:
HIV-infected at screening or enrollment

Annotated entities:
- Condition: "HIV-infected"
- Temporal: "at screening"
- Temporal: "at enrollment"